一位成年男性，因急性膽囊炎施行腹腔鏡膽囊摘除術（laparoscopic cholecystectomy），術中會造成病患動脈血中二氧化碳分壓（PaCO2）上升的原因，下列何者錯誤？
A. 體溫逐漸下降
B. 腹腔內二氧化碳的吸收
C. 麻醉深度不足下，代謝率上升
D. 肺泡換氣/肺部灌流不相稱（VA /Q mismatch）

正確答案：A. 體溫逐漸下降